Clinical trial exclusion criterion:
A positive test for Human Immunodeficiency Virus (HIV) antibody.

Entity relations:
- Has_value("Human Immunodeficiency Virus (HIV) antibody", "positive")